Sensitivity to pilocarpine

The above is a clinical trial exclusion criterion. Annotated with entity spans:
[Condition: Sensitivity] to [Drug: pilocarpine]